正常新生兒之呼吸次數應在下列何範圍之內？
A. 10~20 次/分鐘
B. 20~30 次/分鐘
C. 40~60 次/分鐘
D. 70~80 次/分鐘

正確答案：C. 40~60 次/分鐘